Clinical trial inclusion criterion:
1. Male or female of any race, at least 18 years of age at Visit 1 Screening.

Annotated entities:
- Parsing_Error: "1."
- Person: "Male"
- Person: "female"
- Value: "at least 18 years"
- Person: "age"
- Temporal: "at Visit 1 Screening"
- Reference_point: "Visit 1 Screening"